Clinical trial exclusion criterion:
Pregnancy/breastfeeding

Annotated entities:
- Condition: "Pregnancy"
- Observation: "breastfeeding"